有關抗菌藥物與其他藥物併用可能發生交互影響之敘述，下列何者錯誤？
A. Erythromycin 與 theophylline 併用會增加 theophylline 毒性
B. Clarithromycin 與 Statin 類降血脂藥物併用可能發生橫紋肌溶解
C. Trimethoprim-sulfamethoxazole 與 digoxin 併用可能會發生 digoxin 毒性反應
D. Fluoroquinolone 與制酸劑併用會增強 fluoroquinolone 藥效

正確答案：D. Fluoroquinolone 與制酸劑併用會增強 fluoroquinolone 藥效